Cannot communicate with investigators

The above is a clinical trial exclusion criterion. Annotated with entity spans:
[Observation: Cannot communicate] with investigators